Patients with important organ dysfunctions.

The above is a clinical trial exclusion criterion. Annotated with entity spans:
Patients with [Qualifier: important] [Condition: organ dysfunctions].